下列何種疾病最不適合哺餵母乳？
A. B 型肝炎
B. 巨細胞病毒感染
C. 愛滋病
D. 生殖器疱疹

正確答案：C. 愛滋病